What is the indication for isradipine?

The calcium antagonist isradipine is used for hypertensive therapy.